Clinical trial exclusion criterion:
Substance abuse, such as alcohol (>80 g/day), I.V. drugs and inhaled drugs in the past 2 years.

Entity relations:
- Has_multiplier("alcohol", ">80 g/day")
- Has_qualifier("Substance abuse", "alcohol")
- Has_temporal("Substance abuse", "in the past 2 years.")
- OR("alcohol", "I.V. drugs", "inhaled drugs")